以下關於乳糜胸（chylothorax）的描述，何者正確？
A. 乳糜胸是指肋膜腔內發炎或化膿，看起來顏色類似牛乳
B. 乳糜液內的白血球以嗜中性白血球（neutrophils）為主
C. 乳糜胸的病患必須將胸管結紮才能根治
D. 乳糜胸之胸水為淋巴液，含高濃度之三酸甘油酯（triglycerides）

正確答案：D. 乳糜胸之胸水為淋巴液，含高濃度之三酸甘油酯（triglycerides）